自來水中之消毒副產物，主要為所加之氯與下列何類物質作用所產生？
A. 有機物
B. 砷
C. 鉛
D. 硝酸鹽

正確答案：A. 有機物